Clinical trial exclusion criterion:
Planned fast for cultural/ religious reasons e.g. Ramadan

Annotated entities:
- Non-query-able: "Planned fast for cultural/ religious reasons e.g. Ramadan"